Clinical trial inclusion criteria:
all adult patients with a nasal or facial skin/soft tissue defect requiring reconstruction limited to or including a full-thickness skin graft

Annotated entities:
- Condition: "facial skin/soft tissue defect"
- Condition: "nasal skin/soft tissue defect"
- Procedure: "reconstruction"
- Mood: "requiring"
- Device: "full-thickness skin graft"